下列何種藥物適合以靜脈注射方式，用於治療急性且嚴重的氣喘或是慢性肺阻塞（COPD）的病人？
A. cromolyn
B. tiotropium
C. montelukast
D. methylprednisolone

正確答案：D. methylprednisolone